Pregnant or nursing woman

The above is a clinical trial exclusion criterion. Annotated with entity spans:
[Condition: Pregnant] or [Condition: nursing] [Person: woman]